下列關於移植後的心臟生理之敘述，何者最正確？
A. 運動時最大心跳率較手術前高
B. 運動後較慢恢復至運動前心跳率
C. 副交感神經的影響較交感神經大
D. 靜脈回心血量（venous return）不影響其心搏量（stroke volume）

正確答案：B. 運動後較慢恢復至運動前心跳率